Severe liver failure (CI to oral AVK)

The above is a clinical trial exclusion criterion. Annotated with entity spans:
[Qualifier: Severe] [Condition: liver failure] (CI to oral AVK)